下列藥物中，何者對多發性骨髓瘤的治療效果最好？
A. Gifitinib
B. Bevacizumab
C. Trastuzumab
D. Bortezomib

正確答案：D. Bortezomib